Clinical trial exclusion criterion:
Known renal failure or allergy to acetazolamide and other sulfonamides

Entity relations:
- AND("allergy", "acetazolamide")
- OR("acetazolamide", "sulfonamides")
- OR("renal failure", "allergy")